Clinical trial exclusion criterion:
Documented renal failure

Annotated entities:
- Condition: "renal failure"